若慢性咳嗽患者合併有大量臭味之黏液膿樣的痰，下列何者為最可能之診斷？
A. 過敏性鼻炎（allergic rhinitis）
B. 肺水腫（pulmonary edema）
C. 肺栓塞症（pulmonary embolism）
D. 支氣管擴張症（bronchiectasis）

正確答案：D. 支氣管擴張症（bronchiectasis）